Clinical trial inclusion criterion:
Patients receiving once daily dosing of methylprednisolone or prednisone in a dose of 10 mg/day or greater

Annotated entities:
- Multiplier: "once daily"
- Drug: "methylprednisolone"
- Drug: "prednisone"
- Multiplier: "10 mg/day or greater"